El miracidio es una fase larvaria que forma parte del ciclo biológico de un:
1. Pediculus.
2. Ascaris.
3. Oxiuro.
4. Tremátodo.
5. Flebotomo.

Respuesta correcta: 4. Tremátodo.